Clinical trial inclusion criterion:
Being in good health, with no significant medical history;

Annotated entities:
- Condition: "good health"
- Undefined_semantics: "good health"
- Subjective_judgement: "Being in good health, with no significant medical history;"